Han Wistar and Sprague Dawley are breeds of what laboratory animal?

Han-Wistar and Sprague-Dawley rats